Clinical trial exclusion criteria:
hypersensitivity to perindopril or to other ACE inhibitors, amlodipine, atorvastatin, dihydropyridines or to or statins
angioneurotic edema in medical history (hereditary / idiopathic or associated with prior treatment with ACE inhibitors)
severe hypotension, shock, including cardiogenic shock
hemodynamically unstable heart failure
Active liver disease or unexplained persistent elevations of serum transaminases more than three times normal
Women of childbearing age without reliable contraception
pregnancy
breastfeeding
Patients with contraindications listed in the currently valid SP

Annotated entities:
- Condition: "hypersensitivity"
- Drug: "perindopril"
- Drug: "ACE inhibitors"
- Drug: "amlodipine"
- Drug: "atorvastatin"
- Drug: "dihydropyridines"
- Drug: "statins"
- Qualifier: "other"
- Condition: "angioneurotic edema"
- Qualifier: "idiopathic"
- Qualifier: "hereditary"
- Qualifier: "associated"
- Procedure: "treatment"
- Temporal: "prior"
- Drug: "ACE inhibitors"
- Condition: "hypotension"
- Condition: "shock"
- Condition: "cardiogenic shock"
- Qualifier: "severe"
- Qualifier: "hemodynamically unstable"
- Condition: "heart failure"
- Condition: "liver disease"
- Measurement: "serum transaminases"
- Value: "more than three times normal"
- Value: "elevations"
- Qualifier: "unexplained"
- Qualifier: "persistent"
- Person: "Women"
- Person: "childbearing age"
- Qualifier: "reliable"
- Procedure: "contraception"
- Negation: "without"
- Condition: "pregnancy"
- Observation: "breastfeeding"
- Condition: "contraindications"
- Qualifier: "listed in the currently valid SP"